Clinical trial exclusion criterion:
Ongoing serious bacterial infections at the time of screening.

Entity relations:
- Has_index("at the time of screening", "screening")
- Has_qualifier("bacterial infections", "serious")
- Has_temporal("bacterial infections", "at the time of screening")